Clinical trial inclusion criteria:
patients aged >18, <75, left ventricle ejection fraction (LVEF) >50%, multivessel coronary disease detected by coronarography, indication to receive a CABG, stable CAD. All diabetics and non diabetics.

Annotated entities:
- Person: "aged"
- Value: ">18, <75"
- Measurement: "left ventricle ejection fraction"
- Measurement: "LVEF"
- Value: ">50%"
- Condition: "multivessel coronary disease"
- Procedure: "coronarography"
- Procedure: "CABG"
- Mood: "indication to receive"
- Qualifier: "stable"
- Condition: "CAD"
- Condition: "diabetics"
- Condition: "non diabetics"